Family or personal history of medullary thyroid carcinoma

The above is a clinical trial exclusion criterion. Annotated with entity spans:
[Observation: Family] or [Temporal: personal history] of [Condition: medullary thyroid carcinoma]